En el tratamiento de alcoholismo, ¿en qué se basa la Terapia de Exposición a pistas de la conducta de beber?
1. En el Condicionamiento respondiente.
2. En el Condicionamiento operante.
3. En el Aprendizaje social.
4. En la Saciación.
5. En la Reatribución cognitiva.

Respuesta correcta: 1. En el Condicionamiento respondiente.